下列何種疾病自然緩解（spontaneous regression）的機率最低？
A. 唐氏症（Down syndrome）新生兒之骨髓增生症候群（myeloproliferative syndrome）
B. 4S 期（stage 4S）之嬰兒神經母細胞瘤（neuroblastoma）
C. 尾椎（sacrococcygeal）部位之良性畸胎瘤（teratoma）
D. 嬰兒草莓樣血管瘤（hemangioma）

正確答案：C. 尾椎（sacrococcygeal）部位之良性畸胎瘤（teratoma）